La diabetes mellitus tipo 1 del niño se caracteriza por todo lo siguiente EXCEPTO:
1. La alteración poligénica y los factores ambientales conducen a la destrucción autoinmune de los islotes del páncreas.
2. Precisa administración diaria de insulina exógena.
3. Los pacientes tienen requerimientos nutricionales diferentes a los de la población general.
4. Las complicaciones a largo plazo se relacionan con la hiperglucemia.

Respuesta correcta: 3. Los pacientes tienen requerimientos nutricionales diferentes a los de la población general.